Use of an investigational drug within 30 days of randomization, or within 5 half-lives of the investigational drug (the longer period will apply)

The above is a clinical trial exclusion criterion. Annotated with entity spans:
Use of an [Drug: investigational drug] [Temporal: within 30 days of randomization], or [Temporal: within 5 half-lives of the investigational drug] (the longer period will apply)